Clinical trial exclusion criteria:
Patient with a chronic pain condition, major unexpected surgical complication, unexpected prolonged intubation, patient refusal, local anesthetic allergy, any contraindication to regional anesthesia, greater than 2 attempts by resident and greater than 1 attempt by staff anesthesiologist for TAP block.

Annotated entities:
- Condition: "chronic pain condition"
- Qualifier: "major"
- Condition: "unexpected surgical complication"
- Multiplier: "prolonged"
- Procedure: "intubation"
- Qualifier: "unexpected"
- Observation: "patient refusal"
- Drug: "local anesthetic"
- Condition: "allergy"
- Condition: "contraindication"
- Drug: "regional anesthesia"
- Multiplier: "greater than 2"
- Multiplier: "greater than 1"
- Procedure: "TAP block"
- Person: "resident"
- Person: "anesthesiologist"